Current diagnostic of asthma

The above is a clinical trial exclusion criterion. Annotated with entity spans:
[Temporal: Current] [Condition: diagnostic of asthma]